Clinical trial exclusion criterion:
Age > 85 years

Annotated entities:
- Person: "Age"
- Value: "> 85 years"